Patients have a history of allergy to one component of triple therapy regimen (proton pump inhibitor, penicillin, and / or macrolide) before.

The above is a clinical trial exclusion criterion. Annotated with entity spans:
Patients have a [Temporal: history] of [Condition: allergy] to one [Drug: component of triple therapy regimen] ([Drug: proton pump inhibitor], [Drug: penicillin], and / or [Drug: macrolide]) before.